La voltamperometría de barrido lineal se caracteriza por:
1. Ser una técnica fundamentada en un régimen de difusión estacionario.
2. Ser una técnica voltamperométrica fundamentada en un régimen de difusión pura.
3. Utilizar un electrodo rotatorio como electrodo de trabajo.
4. Utilizar un electrodo de gota colgante como electrodo de trabajo.
5. Tener una etapa de preconcentración electródica.

Respuesta correcta: 2. Ser una técnica voltamperométrica fundamentada en un régimen de difusión pura.